Clinical trial exclusion criterion:
8. Life expectancy <1 yr.;

Annotated entities:
- Parsing_Error: "8."
- Observation: "Life expectancy"
- Value: "<1 yr"